Which compound is a specific inhibitor for Nox1 and Nox4?

GKT136901 is a specific inhibitor of Nox1 and Nox4.